Concomitant interstitial lung disease, sarcoidosis, other significant lung disease.

The above is a clinical trial exclusion criterion. Annotated with entity spans:
[Temporal: Concomitant] [Condition: interstitial lung disease], [Condition: sarcoidosis], other significant [Condition: lung disease].